出生三週的男孩，餵食時常出現嘔吐，進而演變成不含膽汁的噴射性嘔吐，身體檢查發現腹部有一腫塊，最可能的診斷為何？
A. 食道失弛症（achalasia）
B. 幽門狹窄（pyloric stenosis）
C. 環狀胰臟（annular pancreas）
D. 小腸閉鎖（small intestine atresia）

正確答案：B. 幽門狹窄（pyloric stenosis）